Clinical trial inclusion criterion:
Male and female subjects 18-80 years.

Entity relations:
- Has_value("years", "18-80")
- OR("Male", "female")